對於胰臟惡性腫瘤的治療方法，下列何種治療較少使用？
A. 手術
B. 化學
C. 放射線
D. 免疫

正確答案：D. 免疫